有關人類粒線體的敘述，下列何者正確？
A. 有些粒線體蛋白質由細胞核內基因所合成
B. 粒線體內 genome 是直線型雙股 DNA
C. 粒線體內 tRNA 及 rRNA 分子全部來自細胞質
D. 粒線體內 genome 不會產生突變

正確答案：A. 有些粒線體蛋白質由細胞核內基因所合成